Clinical trial exclusion criterion:
Desire/intent to become pregnant over the course of the study

Entity relations:
- multi("Desire/intent to become pregnant", "pregnant")
- Has_temporal("Desire/intent to become pregnant", "over the course of the study")